Clinical trial exclusion criteria:
Previous or concurrent malignancy, except for adequately treated basal cell or squamous cell skin cancer, in situ cervical cancer, or any other cancer for which the patient has been previously treated and the lifetime recurrence risk is less than 30%
Inflammatory bowel disease that is uncontrolled or on active treatment (Crohn's disease, ulcerative colitis)
Diarrhea, grade 1 or greater by the National Cancer Institute Common Terminology Criteria for Adverse Events (NCI-CTCAE, version [v] 4.0)
Neuropathy, grade 2 or greater by NCI-CTCAE, v 4.0
Serious underlying medical or psychiatric illnesses that would, in the opinion of the treating physician, substantially increase the risk for complications related to treatment
Active uncontrolled bleeding
Pregnancy or breastfeeding
Major surgery within 4 weeks
Patients with any polymorphism in UGT1A1 other than *1 or *28 (e.g, *6) will be allowed and treated as in the *28/*28 dosing group

Annotated entities:
- Condition: "malignancy"
- Qualifier: "Previous"
- Qualifier: "concurrent"
- Negation: "except"
- Condition: "squamous cell skin cancer"
- Condition: "basal cell skin cancer"
- Condition: "cervical cancer"
- Qualifier: "in situ"
- Qualifier: "adequately treated"
- Non-query-able: "any other cancer for which the patient has been previously treated and the lifetime recurrence risk is less than 30%"
- Condition: "Inflammatory bowel disease"
- Qualifier: "uncontrolled"
- Procedure: "treatment"
- Condition: "Crohn's disease"
- Condition: "ulcerative colitis"
- Condition: "Diarrhea"
- Measurement: "National Cancer Institute Common Terminology Criteria for Adverse Events"
- Value: "grade 1 or greater"
- Measurement: "NCI-CTCAE, version [v] 4.0"
- Condition: "Neuropathy"
- Measurement: "NCI-CTCAE, v 4.0"
- Value: "grade 2 or greater"
- Non-query-able: "Serious underlying medical or psychiatric illnesses that would, in the opinion of the treating physician, substantially increase the risk for complications related to treatment"
- Condition: "bleeding"
- Qualifier: "Active"
- Qualifier: "uncontrolled"
- Pregnancy_considerations: "Pregnancy or breastfeeding"
- Procedure: "Major surgery"
- Temporal: "within 4 weeks"
- Non-query-able: "Patients with any polymorphism in UGT1A1 other than *1 or *28 (e.g, *6) will be allowed and treated as in the *28/*28 dosing group"